下列何者不是手術中生理功能監測之必備項目？
A. 腦波
B. 心電圖
C. 血壓
D. 血氧飽和度

正確答案：A. 腦波